Clinical trial exclusion criterion:
2. Subjects with platinum-refractory disease, defined as disease progression while receiving first line platinum-based therapy.

Annotated entities:
- Parsing_Error: "2."
- Condition: "platinum-refractory disease"
- Undefined_semantics: "platinum-refractory disease"
- Condition: "disease progression"
- Temporal: "while receiving first line platinum-based therapy"
- Reference_point: "first line platinum-based therapy"